Anamnestic history of hypersensitivity to the study drugs or to drugs with similar chemical structures

The above is a clinical trial exclusion criterion. Annotated with entity spans:
[Temporal: Anamnestic history] of [Condition: hypersensitivity] to the [Drug: study drugs] or to [Drug: drugs with similar chemical structures]